內臟大神經（greater splanchnic nerve）起自脊髓的那個段位？
A. T2～4
B. T5～9
C. T11～12
D. L1～2

正確答案：B. T5～9